Clinical trial exclusion criterion:
HBV infected or HCV infected (these increase the risk of TB-drug induced hepatotoxicity)

Annotated entities:
- Condition: "HBV infected"
- Condition: "HCV infected"
- Non-representable: "(these increase the risk of TB-drug induced hepatotoxicity)"